14. Serum potassium<3.2mmol/L, or>5.5mmol/L;

The above is a clinical trial exclusion criterion. Annotated with entity spans:
14. [Measurement: Serum potassium][Value: <3.2mmol/L], or[Value: >5.5mmol/L];